Clinical trial exclusion criterion:
Current DVT

Entity relations:
- Has_temporal("DVT", "Current")